Clinical trial exclusion criterion:
fetal anomalies

Annotated entities:
- Condition: "fetal anomalies"